一位 20 歲男性因突發四肢無力至急診室就診，血壓 150/90 mmHg，心跳 110 次/分鐘，血液檢查發現：鈉 138 mmol/L，鉀 2.4 mmol/L，氯 106 mmol/L，肌酸酐 0.9 mg/dL，滲透度 290 mOsmol/kgH2O，pH 值 7.40，重碳酸根 23 mmol/L；尿液檢查發現：肌酸酐 98.5 mg/dL，鈉 102 mmol/L，鉀 10.4 mmol/L，氯 98 mmol/L，滲透度 600 mOsmol/kg H2O。則下列敘述，何者錯誤？
A. 病患可能罹患甲狀腺功能亢進，需檢測病患之甲狀腺功能
B. 病患因尿液排泄大量鉀離子，需大量補充鉀離子
C. 鉀離子之補充加入生理食鹽水（normal saline）比加入 5%葡萄糖要好
D. 需密切監測血鉀，以避免反彈性高血鉀

正確答案：B. 病患因尿液排泄大量鉀離子，需大量補充鉀離子